一位住在台南將軍鄉之 48 歲男性近日發現有斷斷續續之無痛性血尿，並有片狀血塊出現。病人並未服用 aspirin，但有結石病史，也有長期吸菸、喝酒之習慣。以上病情中何者對於「病因診斷」無明顯價值？
A. 病人住在將軍鄉
B. 血尿形態
C. 病人無使用 aspirin
D. 病人有喝酒之習慣

正確答案：D. 病人有喝酒之習慣